Has a known history of corneal hypoesthesia (reduced corneal sensitivity)

The above is a clinical trial exclusion criterion. Annotated with entity spans:
Has a known [Temporal: history] of [Condition: corneal hypoesthesia] ([Condition: reduced corneal sensitivity])